El denominado “Gas de síntesis” que se utiliza para la preparación de metanol en gran escala consiste en una mezcla a presión de:
1. CO2 e hidrógeno.
2. CO, hidrógeno y agua.
3. CO2, hidrogeno y agua.
4. CO e hidrógeno.
5. Ninguna de las anteriores.

Respuesta correcta: 4. CO e hidrógeno.